Clinical trial exclusion criterion:
Inability to speak English;

Annotated entities:
- Post-eligibility: "Inability to speak English"